Clinical trial inclusion criterion:
Unable to participate in all scheduled visits, treatment plan, or other trial procedures according to the protocol (except for the optional genetic component)

Annotated entities:
- Observation: "Unable to participate"
- Visit: "scheduled visits"
- Mood: "treatment plan"
- Procedure: "trial procedures"
- Negation: "except for"
- Observation: "genetic component"